下列那一種妊娠滋養細胞腫瘤（gestational trophoblastic neoplasia, GTN），對化療的反應最差？
A. 絨毛腺癌（choriocarcinoma）
B. 胎盤處滋養細胞腫瘤（placental-site trophoblastic tumor）
C. 侵襲性（invasive）GTN
D. 轉移性（metastatic）GTN

正確答案：B. 胎盤處滋養細胞腫瘤（placental-site trophoblastic tumor）